Clinical trial inclusion criteria:
symptomatic Dupuytrens contracture with palpable cord, involving MCP, total contracture size over 30 degrees

Annotated entities:
- Condition: "Dupuytrens contracture"
- Qualifier: "symptomatic"
- Condition: "palpable cord"
- Qualifier: "involving MCP"
- Measurement: "total contracture size"
- Value: "over 30 degrees"